Ammonium ion（NH4+）可藉由下列何種方式，由骨骼肌細胞運送到肝細胞代謝？
A. Krebs cycle
B. glucose-alanine cycle
C. urea cycle
D. citric acid cycle

正確答案：B. glucose-alanine cycle